Clinical trial inclusion criterion:
Not planning to change use of medications known to influence appetite or metabolism

Annotated entities:
- Mood: "planning to change"
- Drug: "medications known to influence appetite"
- Drug: "medications known to influence metabolism"
- Negation: "Not"